一位 20 歲女性，因為肚子痛而至急診，腹部超音波發現胰臟有一直徑約 8 公分的腫瘤，腫瘤內有囊狀結構。經手術切除腫瘤，組織學檢查腫瘤內有一些囊狀結構內充滿出血，腫瘤細胞生長方式為成片排列或者為乳突狀突起。則下列何者為 可能的診斷？
A. congenital cyst of pancreas
B. pancreas divisum
C. solid-pseudopapillary neoplasm
D. pancreatic pseudocyst

正確答案：C. solid-pseudopapillary neoplasm